Any condition that in the opinion of study staff would make participation in the study unsafe or interfere with achieving study objectives

The above is a clinical trial exclusion criterion. Annotated with entity spans:
Any [Condition: condition] that in the opinion of study staff would [Qualifier: make participation in the study unsafe] or [Qualifier: interfere with achieving study objectives]